Clinical trial inclusion criterion:
Temperature less than 100.4 F

Annotated entities:
- Measurement: "Temperature"
- Value: "less than 100.4 F"